Current or previous history of immune deficiency disorders including a positive human immunodeficiency virus (HIV) result.

The above is a clinical trial exclusion criterion. Annotated with entity spans:
[Temporal: Current] or [Temporal: previous history] of [Condition: immune deficiency disorders] including a [Value: positive] [Measurement: human immunodeficiency virus (HIV)] result.